social security affiliation

The above is a clinical trial inclusion criterion. Annotated with entity spans:
[Observation: social security affiliation]